Subject has a known contraindication to MRE or IC.

The above is a clinical trial exclusion criterion. Annotated with entity spans:
Subject has a known [Condition: contraindication] to [Procedure: MRE] or [Procedure: IC].